肺癌手術後最常見的死亡原因為何？
A. 肺炎合併敗血症（pneumonia with sepsis）
B. 心律不整（arrhythmia）
C. 腎臟衰竭（renal failure）
D. 中風（stroke）

正確答案：A. 肺炎合併敗血症（pneumonia with sepsis）